Clinical trial exclusion criterion:
smoked within the past year

Entity relations:
- Has_temporal("smoked", "within the past year")